Clinical trial inclusion criteria:
Informed consent obtained prior to any screening procedure
Caucasian male or female patient
At least 18 years of age
Weight at least 45 kg
Patient with moderate or severe chronic atopic dermatitis
Good general health ascertained by medical history, physical examination and laboratory determinations, showing no signs of clinically significant findings, except chronic atopic dermatitis
Negative pregnancy test (premenopausal female patient) at screening and use of adequate contraceptive measures (both male and female patients) throughout the study and 30 days after the last cis-UCA dose

Annotated entities:
- Post-eligibility: "Informed consent obtained prior to any screening procedure"
- Person: "Caucasian"
- Person: "male"
- Person: "female"
- Value: "At least 18 years"
- Person: "age"
- Measurement: "Weight"
- Value: "at least 45 kg"
- Condition: "chronic atopic dermatitis"
- Qualifier: "severe"
- Qualifier: "moderate"
- Condition: "Good general health"
- Temporal: "medical history"
- Procedure: "physical examination"
- Procedure: "laboratory determinations"
- Negation: "no"
- Observation: "signs of clinically significant findings"
- Qualifier: "clinically significant"
- Subjective_judgement: "clinically significant"
- Condition: "chronic atopic dermatitis"
- Negation: "except"
- Qualifier: "ascertained by medical history, physical examination and laboratory determinations"
- Measurement: "pregnancy test"
- Value: "Negative"
- Condition: "premenopausal"
- Person: "female"
- Post-eligibility: "Negative pregnancy test (premenopausal female patient) at screening and use of adequate contraceptive measures (both male and female patients) throughout the study and 30 days after the last cis-UCA dose"